Clinical trial exclusion criterion:
Patients with prior fistulotomy, fistulectomy, LIFT, cutting seton or advancement flap procedure

Annotated entities:
- Procedure: "fistulotomy"
- Procedure: "fistulectomy"
- Procedure: "LIFT"
- Procedure: "cutting seton"
- Procedure: "advancement flap procedure"